Clinical trial exclusion criteria:
UTIs = 12 within 1 year
Pregnancy or Lactation
Immune disease
Lactose intolerance
Urinary tract anomaly
Systemic infection
Newly started hormone therapy within the last 6 months
Antibiotic prophylaxis within the last 6 months
a-D-mannose intake within the last month
Use of catheters
Diabetes mellitus
Participation to other studies

Annotated entities:
- Condition: "UTIs"
- Multiplier: "12 within 1 year"
- Temporal: "within 1 year"
- Condition: "Pregnancy"
- Condition: "Lactation"
- Condition: "Immune disease"
- Condition: "intolerance"
- Drug: "Lactose"
- Condition: "Lactose intolerance"
- Condition: "Urinary tract anomaly"
- Condition: "Systemic infection"
- Multiplier: "Newly started"
- Procedure: "hormone therapy"
- Temporal: "within the last 6 months"
- Procedure: "Antibiotic prophylaxis"
- Temporal: "within the last 6 months"
- Drug: "Antibiotic"
- Drug: "a-D-mannose"
- Temporal: "within the last month"
- Device: "catheters"
- Condition: "Diabetes mellitus"
- Competing_trial: "Participation to other studies"